Age over 18 years

The above is a clinical trial inclusion criterion. Annotated with entity spans:
[Person: Age] [Value: over 18 years]